Over 18 years old.

The above is a clinical trial inclusion criterion. Annotated with entity spans:
[Value: Over 18 years old].